La secuencia repetida de los telómeros humanos es:
1. 5´-GGGATT-3´.
2. 3´-CCCTAA-5´.
3. 5´-CCCCAA-5´.
4. 5´-CCTTAA-3.
5. 5´-CCCTAA-3´.

Respuesta correcta: 5. 5´-CCCTAA-3´.